Major subjects of over 40 years (mean age of Meniere's disease 40 to 50 years)

The above is a clinical trial inclusion criterion. Annotated with entity spans:
Major subjects of [Value: over 40 years] (mean age of Meniere's disease 40 to 50 years)